El papiloma virus humano (HPV) está implicado en la patogenia del:
1. Cáncer de cérvix.
2. Cáncer de endometrio.
3. Cáncer de ovario.
4. Cáncer de mama.
5. Linfoma de Burkitt.

Respuesta correcta: 1. Cáncer de cérvix.